下列有關原發性隅角開放型青光眼的敘述，何者錯誤？
A. 屬於進行性的視神經病變（optic neuropathy）
B. 疾病早期常會有視力模糊的症狀
C. 眼壓是造成疾病的危險因子，也是控制疾病的要素
D. 具特殊形態的視神經頭（optic nerve head）病變，有時伴隨視野缺損

正確答案：B. 疾病早期常會有視力模糊的症狀